腦梗塞後，最容易造成下列何種壞死？
A. 液化性壞死
B. 凝固性壞死
C. 脂肪壞死
D. 壞疽性壞死

正確答案：A. 液化性壞死